Investigational product use in the last 6 months

The above is a clinical trial exclusion criterion. Annotated with entity spans:
[Procedure: Investigational product use] [Temporal: in the last 6 months]